What is the role of neurogranin in Alzheimer's disease patients?

Dendritic protein neurogranin is markedly increased in cerebrospinal fluid in Alzheimer's disease patients.  Neurogranin might reflect the neurodegenerative processes within the brain, indicating a role for neurogranin as a potential novel clinical biomarker for synaptic degeneration in AD.
Neurogranin is important for synaptic plasticity and memory.